Clinical trial exclusion criterion:
Patients with medical comorbidities preventing them from definitive surgical therapy.

Entity relations:
- Has_mood("definitive surgical therapy", "preventing them from")
- AND("medical comorbidities", "definitive surgical therapy")